Clinical trial inclusion criterion:
Women with a singleton pregnancy undergoing cesarean section after 37 weeks of gestation.

Annotated entities:
- Person: "Women"
- Condition: "singleton pregnancy"
- Procedure: "cesarean section"
- Value: "after 37 weeks"
- Measurement: "gestation"